Clinical trial inclusion criterion:
Willing and able to return for all study visits.

Annotated entities:
- Post-eligibility: "Willing and able to return for all study visits."